8. Subject is willing to remain in the clinic overnight for PK assessment on Days 0 and 8

The above is a clinical trial inclusion criterion. Annotated with entity spans:
[Parsing_Error: 8.] [Non-query-able: Subject is willing to remain in the clinic overnight for PK assessment on Days 0 and 8]